Clinical trial exclusion criterion:
patients with unilateral or bilateral nephrectomy

Annotated entities:
- Procedure: "nephrectomy"
- Qualifier: "bilateral"
- Qualifier: "unilateral"